Significant illness within the two weeks prior to dosing.

The above is a clinical trial exclusion criterion. Annotated with entity spans:
[Condition: Significant illness] [Temporal: within the two weeks prior] to dosing.